Has a cataract and is expected to undergo clear corneal cataract surgery with phacoemulsification and implantation of a posterior chamber intraocular lens

The above is a clinical trial inclusion criterion. Annotated with entity spans:
Has a [Condition: cataract] and is expected to undergo [Procedure: clear corneal cataract surgery] [Qualifier: with phacoemulsification] and [Qualifier: implantation of a posterior chamber intraocular lens]